Clinical trial exclusion criterion:
regular use of tobacco products

Annotated entities:
- Multiplier: "regular"
- Observation: "use of tobacco products"